El ácido acetilsalicílico es un compuesto cuyo pKa es 3.5. ¿Qué porcentaje de una dosis de dicho producto se podrá absorber en el estómago en ayunas (pH 1.5)?
1. Menos del 10%.
2. Entre un 10% y un 20%.
3. Más del 90%.
4. Entre un 20% y un 40%.
5. Un 50%.

Respuesta correcta: 3. Más del 90%.